Clinical trial exclusion criterion:
Subject is employed by Medtronic or by the department of any of the investigators or is a close relative of any of the investigators.

Annotated entities:
- Post-eligibility: "Subject is employed by Medtronic or by the department of any of the investigators or is a close relative of any of the investigators"